Demonstrate impact of stress urinary incontinence on quality of life questionnaire

The above is a clinical trial inclusion criterion. Annotated with entity spans:
Demonstrate impact of [Condition: stress urinary incontinence] on [Procedure: quality of life questionnaire]